下列那一項因素不會造成某慢性疾病的發生率產生變動？
A. 潛伏期
B. 疾病診斷技術
C. 環境因素
D. 生活習慣

正確答案：A. 潛伏期